有關糖尿病視網膜病變（diabetic retinopathy）之組織病理變化，下列何者錯誤？
A. 微血管基底膜變薄（thinning of the basement membrane）
B. 微小血管阻塞（microvascular occlusion）
C. 微血管外被細胞喪失（loss of pericyte）
D. 血管新生（neovascularization）

正確答案：A. 微血管基底膜變薄（thinning of the basement membrane）